Written parental consent for those under the age of 18

The above is a clinical trial inclusion criterion. Annotated with entity spans:
[Informed_consent: Written parental consent for those under the age of 18]